Clinical trial inclusion criterion:
All patients referred to a participating research centre with suspicion of or confirmed endometrial cancer.

Annotated entities:
- Visit: "participating research centre"
- Mood: "suspicion of"
- Qualifier: "confirmed"
- Condition: "endometrial cancer"